Patients who receive antineoplastic or immunomodulatory therapy in the past 12 months.

The above is a clinical trial exclusion criterion. Annotated with entity spans:
Patients who receive [Procedure: antineoplastic] or [Procedure: immunomodulatory therapy] in the [Temporal: past 12 months].